Clinical trial exclusion criterion:
Clinically significant liver disease.

Entity relations:
- Has_qualifier("liver disease", "Clinically significant")